Clinical trial exclusion criterion:
Having comorbid psychiatric conditions according to the criteria set forth in the DSM-IV(administered by the Mini-International Neuropsychiatric Interview (MINI))

Annotated entities:
- Condition: "psychiatric conditions"
- Qualifier: "comorbid"
- Qualifier: "DSM-IV"